有關真核細胞之蛋白質分解，下列敘述何者錯誤？
A. 均不須 ATP 之參與
B. Trypsin 可水解 lysine 後之胜肽鍵
C. 泛素化（Ubiquitination）參與蛋白質分解機制
D. Lysosome 具 proteases 可以分解胞內蛋白質

正確答案：A. 均不須 ATP 之參與